雖然當日手術（ambulatory surgery）不須住院，可以減少許多醫療支出費用；不過麻醉、開刀後一旦發生下列何狀況，應考慮延遲出院或住院？①嚴重的噁心、嘔吐 ②不穩定的血壓 ③嚴重疼痛尚未獲得控制 ④預期外的手術後遺症
A. 僅②④
B. 僅②③
C. ①②③④
D. 僅③④

正確答案：C. ①②③④